有下列何種染色體異常的兒童急性骨髓性白血病的預後最差？
A. 第 8 及 21 對染色體轉位；t(8;21)
B. 第 16 對染色體倒位；inv(16)
C. 第 15 及 17 對染色體轉位；t(15;17)
D. 第 7 對染色體缺失；Del(7q), -7

正確答案：D. 第 7 對染色體缺失；Del(7q), -7